Current non-steroidal anti-inflammatory drug (NSAID) use

The above is a clinical trial exclusion criterion. Annotated with entity spans:
Current [Drug: non-steroidal anti-inflammatory drug] ([Drug: NSAID]) use